Clinical trial inclusion criterion:
resection must have been macroscopically complete laterally,

Entity relations:
- Has_qualifier("resection", "macroscopically complete laterally")